Signs or symptoms suspicious for Primary HIV Infection (PHI).

The above is a clinical trial exclusion criterion. Annotated with entity spans:
[Condition: Signs] or [Condition: symptoms] suspicious for [Condition: Primary HIV Infection] ([Condition: PHI]).